What is Telangiectasia?

Telangiectasia (macroscopically visible dilated skin vessels)